Multiple pregnancy (more than 3 fetuses)

The above is a clinical trial exclusion criterion. Annotated with entity spans:
[Condition: Multiple pregnancy] ([Value: more than 3] [Measurement: fetuses])